normal liver and kidney function

The above is a clinical trial inclusion criterion. Annotated with entity spans:
[Condition: normal liver] and kidney function